Previous large bowel/rectal surgery

The above is a clinical trial exclusion criterion. Annotated with entity spans:
Previous [Procedure: large bowel][Parsing_Error: /][Procedure: rectal surgery]